Patients receiving contraindicated medication.

The above is a clinical trial exclusion criterion. Annotated with entity spans:
Patients receiving [Drug: contraindicated medication].